Clinical trial inclusion criterion:
Nonsmoking for 4 months prior to initial interview and throughout screening

Entity relations:
- Has_index("throughout screening", "screening")
- Has_temporal("Nonsmoking", "for 4 months prior to initial interview")
- Has_temporal("Nonsmoking", "throughout screening")
- Has_index("for 4 months prior to initial interview", "initial interview")